Clinical trial exclusion criterion:
11. Use of colchicine, methotrexate, azathioprine, or systemic steroids in the two months preceding screening

Annotated entities:
- Parsing_Error: "11."
- Drug: "colchicine"
- Drug: "methotrexate"
- Drug: "azathioprine"
- Drug: "systemic steroids"
- Temporal: "in the two months preceding screening"
- Reference_point: "screening"